Clinical trial exclusion criterion:
History of any chemotherapy for MBC.

Annotated entities:
- Procedure: "chemotherapy"
- Condition: "MBC"
- Temporal: "History"